¿Cuál de las siguientes “especies reactivas de oxígeno (ROS)” es la más reactiva atacando moléculas biológicas?:
1. Anión superóxido.
2. Radical peroxilo.
3. Radical hidroxilo.
4. Peróxido de hidrógeno.

Respuesta correcta: 3. Radical hidroxilo.